Clinical trial inclusion criterion:
Chronic hepatitis B,

Annotated entities:
- Condition: "Chronic hepatitis B"